14歲男孩主訴於右大腿出現逐漸長大的腫瘤約一年。病史詢問發現局部有痛感，尤其久站後疼痛明顯，經診斷為肌肉內血管瘤 （intramuscular hemangioma）。有關診斷、預後及處置之敘述，下列何者最正確？
A. 大部分腫瘤還會繼續增大造成肢體變形
B. 往往需要手術切除以解決疼痛
C. 可能發生遠處轉移
D. 腫瘤越深層愈不易診斷，易誤判為惡性腫瘤

正確答案：D. 腫瘤越深層愈不易診斷，易誤判為惡性腫瘤